¿En qué modalidad cromatográfica la fase estacionaria está formada por partículas sólidas con tamaño de poro controlado? :
1. Cromatografía de reparto en fase normal.
2. Cromatografía de reparto en fase reversa.
3. Cromatografía de par iónico.
4. Cromatografía de intercambio iónico.
5. Cromatografía de exclusión molecular o por tamaños.

Respuesta correcta: 5. Cromatografía de exclusión molecular o por tamaños.